Clinical trial exclusion criterion:
Lumbar spinal surgery within the preceding six months

Annotated entities:
- Procedure: "Lumbar spinal surgery"
- Temporal: "within the preceding six months"